Clinical trial exclusion criterion:
Concomitant surgical procedure other than CABG

Annotated entities:
- Procedure: "surgical procedure"
- Temporal: "Concomitant"
- Procedure: "CABG"
- Qualifier: "other than"